10. Women currently taking spironolactone

The above is a clinical trial exclusion criterion. Annotated with entity spans:
[Parsing_Error: 10.] [Person: Women] currently taking [Drug: spironolactone]